Clinical trial exclusion criterion:
Patients currently taking benzodiazepine drugs

Entity relations:
- Has_temporal("benzodiazepine drugs", "currently")